Clinical trial inclusion criterion:
Commitment to return for follow up visits

Annotated entities:
- Post-eligibility: "Commitment to return for follow up visits"